Clinical trial inclusion criterion:
Single stroke having occurred more than 6 months before (previous TIA is accepted).

Annotated entities:
- Condition: "stroke"
- Multiplier: "Single"
- Temporal: "more than 6 months"
- Condition: "TIA"